Toda medida experimental viene acompañada del correspondiente error experimental. Los errores experimentales se clasifican en sistemáticos y aleatorios. Sobre éstos últimos se puede afirmar que:
1. Se deben a un fallo del experimento o del equipo.
2. Generalmente originan una desviación positiva de la medida.
3. Tienen igual probabilidad de ser positivos o negativos.
4. No afectan al resultado final por ser aleatorios.
5. Afectan exclusivamente a la exactitud de los resultados que se obtienen.

Respuesta correcta: 3. Tienen igual probabilidad de ser positivos o negativos.